Clinical trial exclusion criterion:
History of corneal transplantation or recent intraocular surgery

Annotated entities:
- Procedure: "corneal transplantation"
- Procedure: "intraocular surgery"